進行頸部淋巴腺廓清術時，當打開頸動脈鞘（carotid sheath）後，其內應無下列何構造？
A. 頸內靜脈
B. 頸總動脈
C. 交感神經幹
D. 迷走神經

正確答案：C. 交感神經幹